Clinical trial inclusion criterion:
Alkaline phosphatase less than or equal to 5 x ULN

Annotated entities:
- Measurement: "Alkaline phosphatase"
- Value: "less than or equal to 5 x ULN"